長期口服嗎啡的病人，在開處方時須同時給予：
A. 鎮靜劑
B. 止癢劑
C. 止瀉劑
D. 軟便劑

正確答案：D. 軟便劑